¿En qué fases del sueño se producen los episodios enuréticos?
1. En las fases de sueño ligero.
2. En las fases de sueño profundo.
3. En las fases de sueño paradójico.
4. En las fases de ensoñación.
5. Indistintamente en cualquier fase del sueño.

Respuesta correcta: 5. Indistintamente en cualquier fase del sueño.